Which TREX mRNA export complex subunits have been implicated in neurodevelopmental disorders?

THOC1, THOC2 and THOC5 have been implicated in neurodegeneration and cancer. THOC6, THO7 and THO8 have been shown to be implicated in NDD's.